Clinical trial inclusion criterion:
Diabetic macular edema involving the center of the macula

Annotated entities:
- Condition: "Diabetic macular edema"
- Qualifier: "center of the macula"